Inability to fully comprehend and/or perform study procedures in the investigator's opinion.

The above is a clinical trial exclusion criterion. Annotated with entity spans:
[Post-eligibility: Inability to fully comprehend and/or perform study procedures in the investigator's opinion].